Clinical trial inclusion criterion:
Biological parameters at the beginning of the study: leucocytes ³ 2000 elements per mm3, hemoglobin ³ 10.5g/dl, platelets ³ 100 000 per mm3, phosphatases alcalines transaminases £ 1 time 1/2 compared to the normal.

Annotated entities:
- Measurement: "leucocytes"
- Value: "³ 2000 elements per mm3"
- Measurement: "hemoglobin"
- Value: "³ 10.5g/dl"
- Measurement: "platelets"
- Value: "³ 100 000 per mm3"
- Measurement: "phosphatases alcalines transaminases"
- Value: "£ 1 time 1/2 compared to the normal"
- Temporal: "at the beginning of the study"
- Reference_point: "the beginning of the study"